signed written informed consent and willingness to comply with treatment and follow-up procedures

The above is a clinical trial inclusion criterion. Annotated with entity spans:
[Informed_consent: signed written informed consent and willingness to comply with treatment and follow-up procedures]